Clinical trial exclusion criterion:
Concurrent diagnosis of chronic obstructive pulmonary disease (COPD) or other respiratory disorders including active tuberculosis, lung cancer, bronchiectasis, sarcoidosis, lung fibrosis, pulmonary hypertension, interstitial lung diseases or other active pulmonary diseases.

Annotated entities:
- Condition: "chronic obstructive pulmonary disease (COPD)"
- Qualifier: "other"
- Condition: "respiratory disorders"
- Qualifier: "active"
- Condition: "tuberculosis"
- Condition: "lung cancer"
- Condition: "bronchiectasis"
- Condition: "sarcoidosis"
- Condition: "lung fibrosis"
- Condition: "pulmonary hypertension"
- Condition: "interstitial lung diseases"
- Qualifier: "other"
- Qualifier: "active"
- Condition: "pulmonary diseases"